Si un paciente presenta a la vez un trastorno depresivo mayor y problemas de pareja, los datos disponibles actualmente indican que en esos casos, entre la terapia conductual de pareja y la terapia cognitiva de Beck, el tratamiento psicológico de elección sería:
1. Cualquiera de las dos terapias, ya que ambas son iguales de eficaces en reducir la sintomatología depresiva y en mejorar la satisfacción de la pareja.
2. La terapia cognitiva de la depresión de Beck, ya que es más eficaz que la terapia conductual de pareja en reducir la sintomatología depresiva.
3. La terapia conductual de pareja, ya que la terapia cognitiva de Beck no es eficaz para la depresión cuando hay problemas de pareja.
4. La terapia conductual de pareja, ya que es igual de eficaz que la terapia cognitiva de Beck en reducir la sintomatología depresiva, pero mejora más la satisfacción de la pareja.
5. La terapia cognitiva de Beck, ya que la terapia conductual de pareja no ha demostrado empíricamente su eficacia para la depresión.

Respuesta correcta: 4. La terapia conductual de pareja, ya que es igual de eficaz que la terapia cognitiva de Beck en reducir la sintomatología depresiva, pero mejora más la satisfacción de la pareja.